Clinical trial exclusion criterion:
Treatment with Urinary alkalinizers (e.g., sodium lactate, potassium citrate)

Annotated entities:
- Procedure: "Treatment"
- Drug: "Urinary alkalinizers"
- Drug: "sodium lactate"
- Drug: "potassium citrate"